Clinical trial inclusion criterion:
Scheduled to electively undergo open-laparotomy.

Annotated entities:
- Mood: "Scheduled"
- Procedure: "open-laparotomy"
- Mood: "electively"